Señale la opción incorrecta en relación con las reacciones adversas más frecuentes producidas por los siguientes fármacos:
1. Penicilinas: alteración permanente de la coloración de los dientes.
2. Clindamicina: diarrea.
3. Quinolonas: cefaleas.
4. Aminoglucósidos: ototoxicidad.
5. Tetraciclinas: fotosensibilidad.

Respuesta correcta: 1. Penicilinas: alteración permanente de la coloración de los dientes.